一對夫妻，先生 32 歲，太太 30 歲。第一胎小孩為男性，生下來 1 歲以後有發展遲緩現象，基因診斷顯示為 fragile X syndrome。此次懷孕在 20 週時前來就診，下列處理何者最適當？
A. 建議終止懷孕
B. 先以超音波或羊水染色體確定胎兒性別，若為男性，再檢驗 fragile X syndrome 之基因
C. 告知胎兒神經系統異常機會較常人高，最好接受超音波檢查
D. 告知胎兒最好接受羊膜腔穿刺，以檢驗 fragile X syndrome 之基因

正確答案：D. 告知胎兒最好接受羊膜腔穿刺，以檢驗 fragile X syndrome 之基因